Clinical trial exclusion criterion:
Permanent makeup or tattoos with metallic dyes

Entity relations:
- AND("tattoos", "metallic dyes")
- AND("Permanent makeup", "metallic dyes")
- OR("Permanent makeup", "tattoos")